History of, or current, open head brain trauma. Candidates with any metal, shrapnel or other similar objects in the head that could affect the QEEG

The above is a clinical trial exclusion criterion. Annotated with entity spans:
[Temporal: History] of, or [Temporal: current], [Condition: open head brain trauma]. Candidates with any [Device: metal], [Device: shrapnel] or other similar [Device: objects in the head] that could [Condition: affect] the [Procedure: QEEG]